Clinical trial inclusion criterion:
A signed and dated written informed consent is obtained prior to participation.

Entity relations:
- Has_temporal("written informed consent", "prior to participation")